Clinical trial exclusion criterion:
Women of Childbearing potential without proper contraceptive measures, pregnancy or breast feeding

Annotated entities:
- Person: "Women"
- Condition: "Childbearing potential"
- Procedure: "contraceptive measures"
- Negation: "without"
- Condition: "pregnancy"
- Observation: "breast feeding"